Clinical trial inclusion criterion:
6) no antidepressant medications or clinically able to discontinue medications,

Annotated entities:
- Drug: "antidepressant"
- Negation: "no"
- Condition: "clinically able to discontinue medications"
- Undefined_semantics: "clinically able to discontinue medications"
- Subjective_judgement: "clinically able to discontinue medications"
- Parsing_Error: "6)"